一位 75 歲女性，體重 60 Kg，serum creatinine 3 mg/dL，她的 estimated GFR 為多少 ml/min？
A. 45
B. 35
C. 25
D. 15

正確答案：D. 15